Contraindications to warfarin or pradaxa according to Russian Instructions for medical use of these drugs

The above is a clinical trial exclusion criterion. Annotated with entity spans:
[Condition: Contraindications] to [Drug: warfarin] or [Drug: pradaxa] according to [Qualifier: Russian Instructions for medical use] of these drugs